La técnica de extracción que se usa para determinaciones por cromatografía de gases en las que el analito se desorbe o desadsorbe térmicamente se denomina:
1. Extracción líquido-líquido.
2. Extracción en fase sólida.
3. Microextracción en fase sólida.
4. Subextracción en fase sólida.
5. Cristalización.

Respuesta correcta: 3. Microextracción en fase sólida.